下列與手術後血腫（hematoma）相關之敘述，何者錯誤？
A. 血腫可能會發生感染
B. 很多的血腫是因為止血不足而造成
C. 頸部的血腫太大時會影響呼吸道的功能
D. 手術前矯正凝血功能障礙（coagulopathy）並不會降低手術後血腫的發生機率

正確答案：D. 手術前矯正凝血功能障礙（coagulopathy）並不會降低手術後血腫的發生機率